Clinical trial exclusion criterion:
Epilepsy

Annotated entities:
- Condition: "Epilepsy"